8. STEMI or non-STEMI within the past five days

The above is a clinical trial exclusion criterion. Annotated with entity spans:
[Parsing_Error: 8.] [Condition: STEMI] or [Condition: non-STEMI] [Temporal: within the past five days]